Clinical trial inclusion criterion:
Capacity for understanding and signing in the Informed Consent Form;

Annotated entities:
- Post-eligibility: "Capacity for understanding and signing in the Informed Consent Form;"
- Non-query-able: "Capacity for understanding and signing in the Informed Consent Form;"